Has an ASDAS >= 2.1 at Screening

The above is a clinical trial inclusion criterion. Annotated with entity spans:
Has an [Measurement: ASDAS] [Value: >= 2.1] [Temporal: at Screening]